Clinical trial exclusion criterion:
Thrombin or Xa factor inhibitor;

Annotated entities:
- Drug: "Thrombin"
- Drug: "Xa factor inhibitor"